Clinical trial exclusion criterion:
Absolute contraindication to CMR

Annotated entities:
- Condition: "contraindication"
- Procedure: "CMR"